下列色素性病變何者常於中年後發生？
A. nevus of Ota（nevus fuscocaeruleus ophthalmomaxillaris）
B. ephelides（freckle）
C. mongolian spot
D. nevus of Hori（bilateral nevus of Ota-like macules）

正確答案：D. nevus of Hori（bilateral nevus of Ota-like macules）